10. Pregnant or breast feeding

The above is a clinical trial exclusion criterion. Annotated with entity spans:
[Parsing_Error: 10.] [Condition: Pregnant] or [Observation: breast feeding]